下列對於嚴重的卵巢過度刺激症候群（ovarian hyperstimulation syndrome, OHSS）的處理，何者不適當？
A. 使用 hCG 注射
B. 記錄病患輸入輸出量、體重及腹圍
C. 使用白蛋白（albumin）輸液
D. 腹腔放液（paracentesis）

正確答案：A. 使用 hCG 注射